Cardiomyopathy

The above is a clinical trial exclusion criterion. Annotated with entity spans:
[Condition: Cardiomyopathy]